有關冠心症（coronary artery disease）之抗血小板藥物治療，下列敘述何者錯誤？
A. Aspirin 可有效改善病人預後
B. Clopidogrel 可提供類似 aspirin 之療效
C. 合併使用 aspirin 和 clopidogrel 治療慢性穩定性冠心病較單一治療可提供更大療效
D. 使用氫質子幫浦（proton pump）抑制劑可有效減少使用 aspirin 或 clopidogrel 所導致之腸胃出血

正確答案：C. 合併使用 aspirin 和 clopidogrel 治療慢性穩定性冠心病較單一治療可提供更大療效